在 B 型主動脈剝離症，需要手術治療時，其治療的方式為：
A. 必須將降主動脈切除至橫膈膜，以人工血管置換
B. 將有內膜裂口（Intimal tear）的動脈部分切除，以一小段人工血管銜接，使假性腔（False lumen）關閉
C. 將降主動脈用人工血管由外面包起來，以避免破裂
D. 在內膜裂口處的前端及後端，用人工血管繞道

正確答案：B. 將有內膜裂口（Intimal tear）的動脈部分切除，以一小段人工血管銜接，使假性腔（False lumen）關閉